Clinical trial exclusion criterion:
Pressure sores where harness would be applied

Annotated entities:
- Condition: "Pressure sores"
- Device: "harness"